Clinical trial inclusion criterion:
37+0 - 42+0 weeks of gestation

Annotated entities:
- Value: "37+0"
- Value: "42+0"
- Measurement: "weeks of gestation"